Expanded Disability Status Scale (EDSS) score less than equals to (<=) 5.0.

The above is a clinical trial inclusion criterion. Annotated with entity spans:
[Measurement: Expanded Disability Status Scale (EDSS) score] [Value: less than equals to (<=) 5.0].